5. Subjects must report menstrual periods occurring within 21-60 days from the start of one period to the start of the next menstrual period

The above is a clinical trial inclusion criterion. Annotated with entity spans:
5. Subjects must report [Condition: menstrual periods] occurring [Temporal: within 21-60 days from the start of one period] to the start of the next menstrual period